signed informed consent

The above is a clinical trial inclusion criterion. Annotated with entity spans:
[Post-eligibility: signed informed consent]